Cuál de las siguientes asociaciones entre fármacos y Reacción Adversa a Medicamentos NO es correcta:
1. Digoxina-arritmia-Reacción Adversa de tipo A.
2. Atenolol-Bradicardia-Reacción Adversa de tipo A.
3. Furosemida-Hiponatremia-Reacción Adversa de tipo A.
4. Metamizol-Agranulocitosis-Reacción    Adversa de tipo A.

Respuesta correcta: 4. Metamizol-Agranulocitosis-Reacción    Adversa de tipo A.